Clinical trial inclusion criterion:
at least 6 weeks after surgical sterilization by bilateral tubal ligation or bilateral oophorectomy

Entity relations:
- AND("surgical sterilization", "bilateral tubal ligation")
- Has_temporal("bilateral tubal ligation", "at least 6 weeks")
- OR("bilateral tubal ligation", "bilateral oophorectomy")